Clinical trial exclusion criterion:
Patients under the age of 18 years

Annotated entities:
- Person: "age"
- Value: "under 18 years"